Clinical trial inclusion criterion:
age=65 years

Annotated entities:
- Person: "age"
- Value: "=65 years"